Clinical trial inclusion criterion:
RLS symptoms for at least 4 of 7 consecutive evenings/nights during the screening period.

Annotated entities:
- Multiplier: "at least 4 of 7 consecutive evenings/nights"
- Condition: "RLS symptoms"